Clinical trial exclusion criterion:
Spinal cord compression or brain metastases unless asymptomatic, treated and stable (not requiring steroids)

Entity relations:
- Has_negation("steroids", "not")
- Has_negation("asymptomatic", "unless")
- AND("Spinal cord compression", "asymptomatic")
- AND("stable", "steroids")
- Has_negation("treated", "unless")
- Has_negation("stable", "unless")
- OR("Spinal cord compression", "brain metastases")